Inability to use a PCA device or speak the English language

The above is a clinical trial exclusion criterion. Annotated with entity spans:
[Observation: Inability to use] a [Device: PCA device] or speak the English language